Clinical trial exclusion criterion:
Contraindication of ALBIS

Entity relations:
- AND("Contraindication", "ALBIS")